Clinical trial exclusion criterion:
Use of oral steroids or non-steroidal anti-inflammatory agents other than aspirin within 72 hours or 3 times the agent's half-life (whichever is longer)

Entity relations:
- Has_negation("aspirin", "other than")
- AND("non-steroidal anti-inflammatory agents", "aspirin")
- Has_index("within 72 hours", "72 hours")
- Has_index("within 3 times the agent's half-life", "3 times the agent's half-life")
- Has_temporal("oral steroids", "within 72 hours")
- OR("within 72 hours", "within 3 times the agent's half-life")
- OR("oral steroids", "non-steroidal anti-inflammatory agents")